一位 70 歲男性因流鼻血至急診室就診，目前使用口服降血糖藥與阿司匹林（aspirin），下列敘述何者不恰當？
A. 流鼻血常發生在乾、冷的天氣
B. 最常見的出血處為鼻腔前端之 Little area
C. 非侵入性治療包括鼻填塞、局部電燒
D. 病人流鼻血停止後，仍可繼續使用阿司匹林（aspirin）

正確答案：D. 病人流鼻血停止後，仍可繼續使用阿司匹林（aspirin）